Clinical trial inclusion criteria:
Histologically confirmed locally advanced gastric (primary endpoint includes proximal and mid-body stomach) or esophagogastric adenocarcinoma; distal gastric (antral) adenocarcinomas are eligible for enrolment but will not be included in the primary analysis
Locally advanced disease as determined by endoscopic ultrasound (EUS) stage > primary tumor (T) 3 and/or any T, lymph nodes (N)+ disease without metastatic disease (Mx)
All patients must have diagnostic laparoscopy with diagnostic washings for cytology; both cytology positive and negative patients are eligible for enrolment, but only cytology negative patients will be included in the primary analyses; gross peritoneal disease is not eligible
Eastern Cooperative Oncology Group (ECOG) performance status =< 1
Eligible for surgery with curative intent
Absolute neutrophil count (ANC) >= 1250/ul
Hemoglobin >= 9 g/dL
Platelets >= 100,000/ul
Total bilirubin < 1.5 x upper limit of normal
Serum glutamic oxaloacetic transaminase (SGOT) and serum glutamate pyruvate transaminase (SGPT) < 2.5 x upper limit of normal for patients without liver metastases OR SGOT and SGPT < 5 x upper limit of normal for patients with liver metastases
Creatinine =< 1.5 x upper limit of normal
Measurable or non-measurable disease by Response Evaluation Criteria in Solid Tumor (RECIST) 1.1 will be allowed
Women of child-bearing potential and men must agree to use adequate contraception (hormonal or barrier method of birth control; abstinence) prior to study entry and for the duration of study participation, up until 30 days after final study treatment; should a woman become pregnant or suspect that she is pregnant while participating in this study, she should inform her treating physician immediately
Patients taking substrates, inhibitors, or inducers of cytochrome P450, family 3, subfamily A, polypeptide 4 (CYP3A4) should be encouraged to switch to alternative drugs whenever possible, given the potential for drug-drug interactions with irinotecan
Signed informed consent

Annotated entities:
- Condition: "esophagogastric adenocarcinoma"
- Condition: "adenocarcinoma gastric"
- Qualifier: "locally advanced"
- Qualifier: "mid-body stomach"
- Qualifier: "proximal stomach"
- Condition: "adenocarcinomas"
- Qualifier: "distal gastric"
- Qualifier: "antral"
- Non-query-able: "are eligible for enrolment but will not be included in the primary analysis"
- Condition: "disease"
- Qualifier: "Locally advanced"
- Procedure: "endoscopic ultrasound"
- Value: "> primary tumor (T) 3 and/or any T, lymph nodes (N)+ disease without metastatic disease (Mx)"
- Procedure: "EUS"
- Procedure: "laparoscopy"
- Qualifier: "diagnostic"
- Procedure: "washings for cytology"
- Measurement: "cytology"
- Value: "positive"
- Value: "negative"
- Non-query-able: "nly cytology negative patients will be included in the primary analyses; gross peritoneal disease is not eligible"
- Measurement: "Eastern Cooperative Oncology Group performance status"
- Value: "=< 1"
- Measurement: "ECOG"
- Procedure: "surgery"
- Qualifier: "curative"
- Measurement: "Absolute neutrophil count"
- Measurement: "ANC"
- Value: ">= 1250/ul"
- Measurement: "Hemoglobin"
- Value: ">= 9 g/dL"
- Measurement: "Platelets"
- Value: ">= 100,000/ul"
- Measurement: "Total bilirubin"
- Value: "< 1.5 x upper limit of normal"
- Measurement: "Serum glutamic oxaloacetic transaminase"
- Measurement: "SGOT"
- Measurement: "serum glutamate pyruvate transaminase"
- Measurement: "SGPT"
- Value: "< 2.5 x upper limit of normal"
- Negation: "without"
- Condition: "liver metastases"
- Measurement: "SGOT"
- Measurement: "SGPT"
- Value: "< 5 x upper limit of normal"
- Condition: "liver metastases"
- Measurement: "Creatinine"
- Value: "=< 1.5 x upper limit of normal"
- Measurement: "Response Evaluation Criteria in Solid Tumor"
- Measurement: "RECIST"
- Value: "1.1"
- Pregnancy_considerations: "omen of child-bearing potential and men must agree to use adequate contraception (hormonal or barrier method of birth control; abstinence) prior to study entry and for the duration of study participation, up until 30 days after final study treatment; should a woman become pregnant or suspect that she is pregnant while participating in this study, she should inform her treating physician immediately"
- Non-query-able: "Patients taking substrates, inhibitors, or inducers of cytochrome P450, family 3, subfamily A, polypeptide 4 (CYP3A4) should be encouraged to switch to alternative drugs whenever possible, given the potential for drug-drug interactions with irinotecan"
- Informed_consent: "Signed informed consent"